En el análisis de un pedigrí de un rasgo autosómico dominante se observa que:
1. El rasgo aparece más frecuentemente en varones.
2. Las personas no afectadas no trasmiten el rasgo.
3. El rasgo tiende a saltar generaciones.
4. Las personas afectadas tienen a ambos progenitores afectados.
5. El rasgo tiende a aparecer en la progenie de padres emparentados.

Respuesta correcta: 2. Las personas no afectadas no trasmiten el rasgo.